Clinical trial exclusion criterion:
Regularly taking prescribed analgesia

Entity relations:
- Has_qualifier("analgesia", "Regularly")